Clinical trial exclusion criterion:
Pregnancy/breastfeeding

Entity relations:
- OR("Pregnancy", "breastfeeding")